Una enfermera que basa su ejercicio profesional en el modelo conceptual de Virginia Henderson:
1. Centra su atención sobre las necesidades fundamentales de la persona, y sus intervenciones van dirigidas a conservar o restablecer la independencia de la persona en la satisfacción de estas necesidades.
2. Ve el cuidado de la persona como el establecimiento y mantenimiento de una relación enfermera-cliente que favorece el desarrollo.
3. Basa sus actuaciones en estrategias de promoción de la adaptación de la persona que está en constante interacción con un entorno cambiante que influye en sus necesidades fundamentales.
4. Considera en sus cuidados, como una presencia auténtica, a la persona que va hacia su actualización y que, a través de sus experiencias de salud, crea conjuntamente para mejorar la calidad de vida, tal y como la persona y su familia la definen.
5. Organiza su actividad para satisfacer las necesidades de cuidados de la persona, con el sistema y modo de enfermería más adecuado.

Respuesta correcta: 1. Centra su atención sobre las necesidades fundamentales de la persona, y sus intervenciones van dirigidas a conservar o restablecer la independencia de la persona en la satisfacción de estas necesidades.